Age 2-17 years

The above is a clinical trial inclusion criterion. Annotated with entity spans:
[Person: Age] [Value: 2-17 years]